Clinical trial exclusion criterion:
Subjects prescribed metformin or have taken metformin within 1 year.

Entity relations:
- Has_temporal("metformin", "within 1 year")
- OR("metformin", "metformin")